Señale cuál de las siguientes afirmaciones, respecto de los terrores nocturnos en la infancia, es correcta:
1. Generalmente el episodio se produce en el último tercio del sueño nocturno.
2. Habitualmente, el niño recuerda el episodio.
3. Los síntomas evidencian la existencia de un trastorno somático.
4. Se produce una relativa ausencia de respuesta al intento de otras personas de despertarlo.
5. El sujeto tiene un acceso rápido a la orientación y alerta.

Respuesta correcta: 4. Se produce una relativa ausencia de respuesta al intento de otras personas de despertarlo.